How many nucleotides long is the HOTAIR CNE?

The HOTAIR CNE is a 32-nucleotide long conserved noncoding element